某25歲護士上班回家後，出現發燒、頭痛、喉嚨痛、流鼻水、打噴嚏、無痰性乾咳、肌肉痛不舒服等症狀，病情持續了4天沒有好轉，反而進一步延伸為細菌性肺炎及肌炎 （myositis），該護士經住院治療二星期後痊癒，此護士可能受下列何病原感染？
A. 麻疹病毒（Measles virus）
B. 呼吸道細胞融合病毒（Respiratory syncytial virus）
C. 流行性感冒病毒（Influenza virus）
D. 腸病毒71型（Enterovirus 71）

正確答案：C. 流行性感冒病毒（Influenza virus）